造成幼兒腦膜炎的流感嗜血桿菌（Haemophilus influenzae）大多屬於下列那個血清型（serotype）？
A. a 型
B. b 型
C. c 型
D. d 型

正確答案：B. b 型